Current treatment with tetracycline or derivative

The above is a clinical trial exclusion criterion. Annotated with entity spans:
[Temporal: Current] [Procedure: treatment] with [Drug: tetracycline] or derivative